Clinical trial exclusion criteria:
Parents refusal
Cognitive impairment
Difficulty in communication due to language issues
Psychiatric disorder
Severe systematic disorder
Known allergy to any drug used

Annotated entities:
- Observation: "Parents refusal"
- Condition: "Cognitive impairment"
- Condition: "Difficulty in communication"
- Condition: "language issues"
- Condition: "Psychiatric disorder"
- Condition: "Severe systematic disorder"
- Condition: "Known allergy"
- Drug: "any drug used"